Clinical trial inclusion criterion:
Primary in-utero drug exposure was opioids other than buprenorphine

Annotated entities:
- Qualifier: "in-utero"
- Observation: "drug exposure"
- Drug: "opioids"
- Negation: "other"
- Drug: "buprenorphine"